Subject with TBS in an actively infected field (Class III Contaminated or Class IV Dirty or Infected)

The above is a clinical trial exclusion criterion. Annotated with entity spans:
Subject with [Condition: TBS] in an actively infected field ([Qualifier: Class III Contaminated] or [Qualifier: Class IV Dirty or Infected])